Use of tobacco products other than cigarettes in past 30 days

The above is a clinical trial exclusion criterion. Annotated with entity spans:
[Observation: Use of tobacco] products [Negation: other than] [Observation: cigarettes] in [Temporal: past 30 days]